Clinical trial inclusion criterion:
PCOS diagnosis based on 2003 Rotterdam criteria

Entity relations:
- Has_qualifier("PCOS", "2003 Rotterdam criteria")